Irritable bowel syndrome (Rome-IV criteria for irritable bowel syndrome)

The above is a clinical trial exclusion criterion. Annotated with entity spans:
[Condition: Irritable bowel syndrome] ([Measurement: Rome-IV criteria] for [Condition: irritable bowel syndrome])